下列何者屬於類固醇類之抗男性荷爾蒙製劑（Steroid antiandrogen）？
A. Cyproterone acetate
B. Flutamide
C. Bicalutamide
D. Ketoconazole

正確答案：A. Cyproterone acetate